Clinical trial exclusion criterion:
Patient with asthma or COPD, patient who is severely respiratory depressed

Annotated entities:
- Condition: "asthma"
- Condition: "COPD"
- Qualifier: "severely"
- Condition: "respiratory depressed"